Clinical trial inclusion criterion:
presence of typical HF symptoms and signs

Annotated entities:
- Condition: "HF symptoms"
- Condition: "HF signs"
- Qualifier: "typical"